Plan for diagnostic-only coronary angiography

The above is a clinical trial exclusion criterion. Annotated with entity spans:
Plan for [Qualifier: diagnostic-only] [Procedure: coronary angiography]